Clinical trial exclusion criterion:
(6)Significant signs of abnormalities as seen in laboratory tests or physical characteristics, which, at the discretion of the investigators, indicates that the patient is experiencing a serious illness or, may affect the observation and evaluation of the drug's efficacy or adverse events, or renders the patient unsuitable for participating in this study;

Entity relations:
- AND("laboratory tests", "signs of abnormalities")
- Has_qualifier("signs of abnormalities", "Significant")